Clinical trial exclusion criteria:
The diagnosis of developmental delay, attention deficit disorder, chronic pain, psychiatric illness, previous open abdominal surgery, the presence of a gastrostomy, ventricular-peritoneal shunt or other abdominal prosthesis, immunosuppression, and those allergic to any of the medications.

Annotated entities:
- Condition: "developmental delay"
- Condition: "attention deficit disorder"
- Condition: "chronic pain"
- Condition: "psychiatric illness"
- Temporal: "previous"
- Procedure: "open abdominal surgery"
- Device: "gastrostomy"
- Device: "ventricular-peritoneal shunt"
- Device: "abdominal prosthesis"
- Condition: "immunosuppression"
- Condition: "allergic"
- Drug: "any of the medications"